Clinical trial exclusion criteria:
Clinically significant systemic disease (such as diabetes, metabolic syndrome, immunological diseases, diagnosed thrombophilia, porphyria, or any other medical condition requiring the use of low-molecular weight heparin therapy)
Polycystic ovary syndrome (PCOS) according to Rotterdam Consensus Criteria (European Society of Human Reproduction and Embryology [ESHRE]/American Society for Reproductive Medicine [ASRM], 2003)
Poor ovarian response (POR) according to the European Society of Human Reproduction and Embryology (ESHRE) Criteria
RIF (repeated implantation failure), defined as greater than or equals to (>=) 2 previous failed embryo transfers
Endometriosis III-IV stage or adenomyosis
Clinically significant findings on exam or ultrasound, such as salpingitis, hydrosalpynx or evidence of ovarian cysts
Known hypersensitivity to any of the components of the solution
Known hypersensitivity to vaginal progesterone or its excipients
Other protocol defined exclusion criteria could apply

Annotated entities:
- Condition: "systemic disease"
- Qualifier: "Clinically significant"
- Condition: "diabetes"
- Condition: "metabolic syndrome"
- Condition: "immunological diseases"
- Condition: "diagnosed thrombophilia"
- Condition: "porphyria"
- Condition: "medical condition"
- Drug: "low-molecular weight heparin"
- Condition: "Polycystic ovary syndrome (PCOS)"
- Qualifier: "Rotterdam Consensus Criteria"
- Qualifier: "European Society of Human Reproduction and Embryology [ESHRE]/American Society for Reproductive Medicine [ASRM], 2003"
- Condition: "Poor ovarian response (POR)"
- Qualifier: "European Society of Human Reproduction and Embryology (ESHRE) Criteria"
- Condition: "RIF (repeated implantation failure)"
- Value: "greater than or equals to (>=) 2"
- Measurement: "previous failed embryo transfers"
- Condition: "Endometriosis"
- Qualifier: "III-IV stage"
- Condition: "adenomyosis"
- Qualifier: "Clinically significant"
- Procedure: "exam"
- Procedure: "ultrasound"
- Condition: "salpingitis"
- Condition: "hydrosalpynx"
- Condition: "ovarian cysts"
- Mood: "evidence"
- Observation: "findings"
- Condition: "hypersensitivity"
- Non-representable: "Known hypersensitivity to any of the components of the solution"
- Drug: "components of the solution"
- Condition: "hypersensitivity"
- Drug: "vaginal progesterone"
- Drug: "excipients"
- Non-representable: "Other protocol defined exclusion criteria could apply"